Dementia

The above is a clinical trial exclusion criterion. Annotated with entity spans:
[Condition: Dementia]